Clinical trial exclusion criterion:
5. AML or antecedent MDS secondary to prior chemotherapy

Entity relations:
- Has_temporal("chemotherapy", "prior")
- Has_temporal("MDS", "antecedent")
- causal("AML", "chemotherapy")
- OR("AML", "MDS")